Which are the main transcriptional activators of circadian oscillations?

BMAL1 and CLOCK.